4. Healthy and self-reported sexually active

The above is a clinical trial inclusion criterion. Annotated with entity spans:
4. [Condition: Healthy] and [Observation: self-reported] [Condition: sexually active]